Clinical trial inclusion criterion:
chronic renal insufficiency requiring dialysis

Annotated entities:
- Condition: "chronic renal insufficiency"
- Procedure: "dialysis"